下列有關幽門桿菌（Helicobacter pylori）的敘述，何者錯誤？
A. 受其感染的人，大部分不會出現症狀
B. 是胃潰瘍、十二指腸潰瘍的主要致病因
C. 帶菌的動物是主要的感染來源
D. 目前尚無有效的疫苗可以預防其感染

正確答案：C. 帶菌的動物是主要的感染來源